Prior Myocardial Infarction and

The above is a clinical trial inclusion criterion. Annotated with entity spans:
Prior [Condition: Myocardial Infarction] and